Clinical trial exclusion criterion:
6. Patients with moderately severe mental disease

Annotated entities:
- Condition: "mental disease"
- Qualifier: "moderately severe"
- Undefined_semantics: "mental disease"